下列何種因素可決定肺順應性（compliance）的大小？① 肺臟的彈性纖維組織（elastic connective tissues） ② 表面張力（surface tension） ③ 呼吸道阻力（airway resistance）
A. ① ②
B. ① ③
C. ② ③
D. ① ② ③

正確答案：A. ① ②